Clinical trial inclusion criterion:
History of blast and/or impact head trauma mTBI meeting Defense and Veterans Brain Injury Center (DVBIC) mTBI criteria, which define mTBI as an injury to the head causing at least one of the following: alteration in consciousness (for up to 24 hours after the injury), loss of consciousness 0-30 minutes, and/or post-traumatic amnesia up to 1 day post-injury. If available, the Glasgow Coma Scale score must be 13-15, and head imaging findings (if imaging was performed) must be negative.

Entity relations:
- Has_context("impact head trauma", "blast")
- Has_temporal("impact head trauma", "History of")
- Has_value("Defense and Veterans Brain Injury Center (DVBIC) mTBI criteria", "meeting")
- AND("impact head trauma", "Defense and Veterans Brain Injury Center (DVBIC) mTBI criteria")
- Has_index("for up to 24 hours after the injury", "the injury")
- Has_temporal("loss of consciousness", "0-30 minutes")
- Has_temporal("alteration in consciousness", "for up to 24 hours after the injury")
- Has_temporal("post-traumatic amnesia", "up to 1 day post-injury")
- Has_negation("findings", "negative")
- AND("head imaging", "findings")
- Has_value("Glasgow Coma Scale", "13-15")
- Subsumes("Defense and Veterans Brain Injury Center (DVBIC) mTBI criteria", "alteration in consciousness")
- OR("alteration in consciousness", "loss of consciousness", "post-traumatic amnesia")